Clinical trial exclusion criterion:
Continues on corticosteroids in previous 3 months prior to randomisation

Annotated entities:
- Drug: "corticosteroids"
- Temporal: "previous 3 months prior to randomisation"
- Reference_point: "randomisation"